Which gene is associated with response to abacavir?

Large studies established the effectiveness of prospective HLA-B*57:01 screening to prevent HSRs to abacavir.